Quality or expressibility score =20 years old: >1 or >20 years old: =1

The above is a clinical trial inclusion criterion. Annotated with entity spans:
[Non-representable: Quality or expressibility score =20 years old: >1 or >20 years old: =1]